Clinical trial exclusion criterion:
Patients on renal dialysis or with end-stage hepatic dysfunction

Entity relations:
- OR("renal dialysis", "end-stage hepatic dysfunction")